Con respecto a la constante de equilibrio:
1. Se puede obtener a partir de la energía de Gibbs estándar de reacción en la situación en la que la energía de Gibbs de reacción alcanza su valor mínimo con respecto al grado de avance de la reacción.
2. Para un equilibrio entre gases ideales se expresa en términos de una relación entre sus molalidades en la mezcla.
3. Se incrementa cuando aumenta la presión sobre el equilibrio manteniendo constante la temperatura.
4. Disminuye cuando lo hace el volumen del recipiente que contiene al sistema en equilibrio a temperatura constante.

Respuesta correcta: 1. Se puede obtener a partir de la energía de Gibbs estándar de reacción en la situación en la que la energía de Gibbs de reacción alcanza su valor mínimo con respecto al grado de avance de la reacción.